Una mujer de 30 años, previamente sana, presenta en el curso de unas 20 horas un cuadro de debilidad facial derecha, de forma que no puede cerrar el ojo derecho y se le ha torcido la boca. Refiere ver doble con la mirada lateral derecha. ¿Cuál de las siguientes posibilidades diagnósticas le parece más probable?
1. Parálisis de Bell.
2. Síndrome de Ramsay-Hunt (parálisis facial herpética).
3. Sarcoidosis.
4. Infarto silviano izquierdo con afectación del opérculo rolándico.
5. Afectación protuberancial por un brote de esclerosis múltiple.

Respuesta correcta: 5. Afectación protuberancial por un brote de esclerosis múltiple.